Clinical trial exclusion criterion:
Previous history of chemical dependence

Annotated entities:
- Condition: "chemical dependence"
- Temporal: "history"
- Temporal: "Previous"